Clinical trial exclusion criterion:
neuropathy/sensory impairment of lower limbs

Annotated entities:
- Condition: "neuropathy"
- Condition: "sensory impairment"
- Qualifier: "lower limbs"